Clinical trial inclusion criterion:
teriflunomide; continuously for no less than 5 years.

Annotated entities:
- Drug: "teriflunomide"
- Temporal: "for no less than 5 years"
- Multiplier: "continuously"